Known active infection, CRP>20 mg/L, clinically significant bleeding, active malignancy.

The above is a clinical trial exclusion criterion. Annotated with entity spans:
Known [Condition: active infection], [Measurement: CRP][Value: >20 mg/L], [Qualifier: clinically significant] [Condition: bleeding], [Qualifier: active] [Condition: malignancy].